Clinical trial exclusion criteria:
Any condition/illness that may affect the study outcomes or would make participation potentially harmful such as pregnancy or breastfeeding, diabetes mellitus, heart disease, stroke, hypertension, malabsorption syndromes, GERD, a history of ulcer, according to a detailed medical history.
Abnormal hepatic function (liver function test > twice the normal range), abnormal renal function (creatinine > 1.1 mg/dl), fasting plasma glucose in the diabetic range (>/= 126 mg/dl), or blood pressure > 140/90 mmHg.
Present alcoholism or drug abuse or use of medications that could interfere with the treatment including bronchodilators, quinolone antibiotics, monoamine oxidase inhibitors, anxiolytics, ranitidine, corticosteroids, growth hormone, antihypertensives.

Annotated entities:
- Condition: "pregnancy"
- Observation: "breastfeeding"
- Condition: "diabetes mellitus"
- Condition: "heart disease"
- Condition: "stroke"
- Condition: "hypertension"
- Condition: "malabsorption syndromes"
- Condition: "GERD"
- Temporal: "history of"
- Condition: "ulcer"
- Condition: "illness that may affect the study outcomes"
- Condition: "illness that would make participation potentially harmful"
- Temporal: "medical history"
- Measurement: "hepatic function"
- Value: "Abnormal"
- Measurement: "liver function test"
- Value: "> twice the normal range"
- Measurement: "renal function"
- Value: "abnormal"
- Measurement: "creatinine"
- Value: "> 1.1 mg/dl"
- Measurement: "fasting plasma glucose"
- Value: "in the diabetic range"
- Value: ">/= 126 mg/dl"
- Measurement: "blood pressure"
- Value: "> 140/90 mmHg"
- Condition: "alcoholism"
- Condition: "drug abuse"
- Drug: "medications that could interfere with the treatment"
- Drug: "bronchodilators"
- Drug: "quinolone antibiotics"
- Drug: "monoamine oxidase inhibitors"
- Drug: "anxiolytics"
- Drug: "ranitidine"
- Drug: "corticosteroids"
- Drug: "growth hormone"
- Drug: "antihypertensives"